Any of gangrene, osteomyelitis, cellulitis, or Charcot osteoarthropathy.

The above is a clinical trial exclusion criterion. Annotated with entity spans:
[Multiplier: Any of] [Condition: gangrene], [Condition: osteomyelitis], [Condition: cellulitis], or [Condition: Charcot osteoarthropathy].